Subjects aged 18 years or older, at the time of signing the informed consent.

The above is a clinical trial inclusion criterion. Annotated with entity spans:
Subjects [Person: aged] [Value: 18 years or older], [Temporal: at the time of signing the informed consent].